Clinical trial exclusion criterion:
Female planning to become pregnant or planning to discontinue contraceptive precautions.

Entity relations:
- Has_mood("contraceptive precautions", "planning to discontinue")
- multi("planning to become pregnant", "become pregnant")
- Has_mood("become pregnant", "planning to")
- OR("planning to become pregnant", "contraceptive precautions")